The patient has a confirmed GAA enzyme deficiency from skin, blood, or muscle tissue and/or 2 confirmed GAA gene mutations.

The above is a clinical trial inclusion criterion. Annotated with entity spans:
The patient has a confirmed [Condition: GAA enzyme deficiency] from [Qualifier: skin], [Qualifier: blood], or [Qualifier: muscle tissue] and/or [Multiplier: 2] confirmed [Observation: GAA gene mutations].